Un chico de 17 años, deportista y sin antecedentes de interés, acude al médico por presentar ictericia conjuntival ocasionalmente. Niega ingesta de fármacos y dolor abdominal. En los análisis realizados se observan cifras de ALT, AST, GGT, y FA normales, con bilirrubina total de 3,2 mgr/dl y bilirrubina directa de 0,4 mgr/dl. No tiene anemia y el hígado es ecográficamente normal. ¿Cuál es su diagnóstico?
1. Síndrome de Rotor.
2. Coledocolitiasis.
3. Síndrome de Dubin-Johnson.
4. Hepatitis aguda.
5. Síndrome de Gilbert.

Respuesta correcta: 5. Síndrome de Gilbert.